Clinical trial inclusion criterion:
Age between 20 and 40

Entity relations:
- Has_value("Age", "between 20 and 40")